Clinical trial inclusion criterion:
eGFR>60 ml/min healthy volunteers type 2 diabetes patients who otherwise healthy

Annotated entities:
- Measurement: "eGFR"
- Value: ">60 ml/min"
- Condition: "healthy"
- Condition: "type 2 diabetes"
- Line: "eGFR>60 ml/min"
- Line: "healthy volunteers"
- Line: "type 2 diabetes patients who otherwise healthy"